Clinical trial exclusion criterion:
Other condition that the Investigator believes puts the patient at risk for a complication during the procedure

Annotated entities:
- Non-query-able: "Other condition that the Investigator believes puts the patient at risk for a complication during the procedure"
- Post-eligibility: "Other condition that the Investigator believes puts the patient at risk for a complication during the procedure"